下列何種酵素活性之抑制可以提升 cAMP 濃度，以減緩氣喘症狀？
A. phospholipase C
B. adenylate cyclase
C. protein kinase A
D. cAMP phosphodiesterase

正確答案：D. cAMP phosphodiesterase